Clinical trial exclusion criterion:
Clinically significant bronchiectasis

Entity relations:
- Has_qualifier("bronchiectasis", "Clinically significant")